Clinical trial exclusion criterion:
Inflammatory arthritis or diabetes,

Entity relations:
- OR("Inflammatory arthritis", "diabetes")